Clinical trial exclusion criterion:
previous intolerance to moderate altitude (<2600m).

Entity relations:
- Has_qualifier("altitude", "moderate")
- Has_value("altitude", "<2600m")
- Has_context("intolerance", "altitude")